Female participants of childbearing potential must have a negative serum pregnancy test (beta human chorionic gonadotropin [beta hCG]) at the Screening visit, and a negative urine pregnancy test pre-dose on Day 1

The above is a clinical trial inclusion criterion. Annotated with entity spans:
[Person: Female] participants of [Condition: childbearing potential] must have a [Value: negative] [Measurement: serum pregnancy test] ([Measurement: beta human chorionic gonadotropin [beta hCG]]) [Temporal: at the Screening visit], and a [Value: negative] [Measurement: urine pregnancy test] [Temporal: pre-dose on Day 1]